Clinical trial exclusion criterion:
Patients with significant clinical abnormalities in CNS, respiratory or cardiovascular function, which in the investigators judgement prevents participation in the study

Annotated entities:
- Condition: "abnormalities in CNS"
- Condition: "abnormalities in cardiovascular function"
- Condition: "abnormalities in respiratory function"